Long-life DSM-IV axis 1 disorders.

The above is a clinical trial exclusion criterion. Annotated with entity spans:
[Condition: Long-life DSM-IV axis 1 disorders].